Polycystic ovary syndrome (PCOS) according to Rotterdam Consensus Criteria (European Society of Human Reproduction and Embryology [ESHRE]/American Society for Reproductive Medicine [ASRM], 2003)

The above is a clinical trial exclusion criterion. Annotated with entity spans:
[Condition: Polycystic ovary syndrome (PCOS)] according to [Qualifier: Rotterdam Consensus Criteria] ([Qualifier: European Society of Human Reproduction and Embryology [ESHRE]/American Society for Reproductive Medicine [ASRM], 2003])